Clinical trial exclusion criterion:
The patient's data will be excluded if they die within 3 days of hospital admission.

Entity relations:
- Has_index("within 3 days of hospital admission", "hospital admission")
- Has_temporal("die", "within 3 days of hospital admission")